Participants with congenital or acquired hypogonadism for whom long-term therapy with placebo would not be medically appropriate

The above is a clinical trial exclusion criterion. Annotated with entity spans:
Participants with [Condition: congenital] or [Condition: acquired hypogonadism] [Non-representable: for whom long-term therapy with placebo would not be medically appropriate]